El grupo NR3 de una sal de amonio cuaternario, R ̶ NR3, es un buen grupo saliente en reacciones:
1. E1.
2. E2.
3. SN1.
4. SN2.
5. En ninguna de las anteriores.

Respuesta correcta: 2. E2.